¿La lesión de qué región puede producir que los pacientes manifiesten juicios morales de tipo utilitario?:
1. La corteza inferotemporal.
2. La corteza prefrontal ventromedial.
3. La corteza parahipocampal.
4. La corteza parietal posterior.

Respuesta correcta: 2. La corteza prefrontal ventromedial.